Clinical trial exclusion criterion:
a history of acute trauma

Annotated entities:
- Condition: "acute trauma"
- Temporal: "history"